Clinical trial exclusion criteria:
Currently pregnant or using a reliable contraception (e.g. injectables, intrauterine devices, implant, oral contraceptive pills)
Desiring pregnancy in the next year
History of tubal ligation or hysterectomy
Contraindication to progestin-only contraceptives
Unable to comprehend consent material because of language barrier or psychological difficulty

Annotated entities:
- Pregnancy_considerations: "Currently pregnant or using a reliable contraception (e.g. injectables, intrauterine devices, implant, oral contraceptive pills)"
- Pregnancy_considerations: "Desiring pregnancy in the next year"
- Procedure: "tubal ligation"
- Procedure: "hysterectomy"
- Non-query-able: "Contraindication"
- Procedure: "contraceptives"
- Drug: "progestin"
- Qualifier: "only"
- Post-eligibility: "Unable to comprehend consent material because of language barrier or psychological difficulty"